Clinical trial exclusion criterion:
Previous hyaluronic acid injection within 6 months

Entity relations:
- multi("hyaluronic acid injection", "hyaluronic acid")
- Has_temporal("hyaluronic acid injection", "within 6 months")
- Has_temporal("hyaluronic acid injection", "Previous")